秀秀是一位 30 週之早產兒，出生體重 1400 公克。出生後罹患呼吸窘迫症候群，需要使用呼吸器、肺表面張力素（surfactant）及藥物來關閉動脈導管，經過 10 天之治療，肺部情況好轉，但此時腦部超音波檢查，診斷出第三腦室內出血，秀秀的父親堅持要主治醫師停止使用呼吸器治療及其他積極性治療。下列主治醫師之何種處置最不恰當？
A. 同意拔掉秀秀的氣管插管，但繼續使用鼻式正壓裝置（nasal CPAP）
B. 告知秀秀父親依秀秀目前肺部之情況，停掉呼吸器她並不會立即死亡，但會造成更大之腦部傷害
C. 勸他等過 2 天後之腦部超音波檢查結果出來後再做決定
D. 繼續目前之治療，轉介給社工師

正確答案：A. 同意拔掉秀秀的氣管插管，但繼續使用鼻式正壓裝置（nasal CPAP）